¿Cómo son los complejos de cromo III solubles en agua?:
1. Son generalmente hexacoordinados y octaédricos. Pueden ser neutros, catiónicos o aniónicos.
2. Habitualmente son plano cuadrados.
3. Son generalmente hexacoordinados y octaédricos, pero todos los ligandos deben oxigeno-dadores.
4. Son generalmente tetraédricos. Todos son cinéticamente muy lábiles: las reacciones de sustitución son muy rápidas, duran segundos.

Respuesta correcta: 1. Son generalmente hexacoordinados y octaédricos. Pueden ser neutros, catiónicos o aniónicos.